18-85 years of age, inclusive

The above is a clinical trial inclusion criterion. Annotated with entity spans:
[Value: 18-85 years] of [Person: age], inclusive